What is the incidence of Edwards syndrom in the european population?

Between 0.125 and 39 in every 1000 live births. Most probably 1:5000 of live-born.